Clinical trial exclusion criterion:
Prior stroke

Entity relations:
- Has_temporal("stroke", "Prior")